Clinical trial exclusion criterion:
pregnancy and breast feeding mothers

Annotated entities:
- Condition: "pregnancy"
- Observation: "breast feeding"